Clinical trial inclusion criterion:
5. Estimated IQ greater than or equal to 85

Entity relations:
- Has_value("Estimated IQ", "greater than or equal to 85")